Initiation or change of dosage of bosentan, sildenafil or calcium channel blockers in the previous month or in the following month

The above is a clinical trial exclusion criterion. Annotated with entity spans:
Initiation or change of dosage of [Drug: bosentan], [Drug: sildenafil] or [Drug: calcium channel blockers] [Temporal: in the previous month] or [Temporal: in the following month]